Clinical trial exclusion criterion:
Pregnant or lactating

Annotated entities:
- Condition: "Pregnant"
- Condition: "lactating"